Non diabetic nephropathy (confirmed by biopsy).

The above is a clinical trial exclusion criterion. Annotated with entity spans:
[Condition: Non diabetic nephropathy] ([Qualifier: confirmed by biopsy]).